La vulcanización es una reacción química:
1. Que se realiza en las fraguas.
2. Que origina entrecruzamiento de las cadenas poliméricas.
3. Que desentrecruza las cadenas poliméricas.
4. Para preparar materiales compuestos.
5. Que conduce al desarrollo de volcanes.

Respuesta correcta: 2. Que origina entrecruzamiento de las cadenas poliméricas.